40 歲女性病人，主訴前頸部痛，病人二週前有上呼吸道感染，理學檢查時發現病人之前頸部皮膚顏色正常，但甲狀腺有局部腫大，硬且有壓痛，病人之血液並無白血球增多的現象，此病人最適當的治療是：
A. 抗生素
B. 手術切除甲狀腺結節
C. 抗甲狀腺藥物
D. 類固醇

正確答案：D. 類固醇